胰凝乳蛋白酶原（chymotrypsinogen）如何轉換形成胰凝乳蛋白酶（chymotrypsin）？
A. 由一蛋白激酶（protein kinase）將胰凝乳蛋白酶原作磷酸化（phosphorylation），而生成胰凝乳蛋白酶
B. 胰凝乳蛋白酶原與 cAMP 結合，而形成胰凝乳蛋白酶
C. 胰凝乳蛋白酶原與鈣離子結合，而形成胰凝乳蛋白酶
D. 胰凝乳蛋白酶原經由蛋白水解（proteolysis），而生成胰凝乳蛋白酶

正確答案：D. 胰凝乳蛋白酶原經由蛋白水解（proteolysis），而生成胰凝乳蛋白酶